Clinical trial exclusion criterion:
A history of intravitreal anti-VEGF injection of any type in the study eye within the last 45 days prior to study enrollment.

Entity relations:
- Has_qualifier("anti-VEGF injection", "intravitreal")
- Has_temporal("anti-VEGF injection", "history of")
- Has_qualifier("anti-VEGF injection", "in the study eye")
- Has_index("within the last 45 days prior to study enrollment", "study enrollment")
- Has_temporal("anti-VEGF injection", "within the last 45 days prior to study enrollment")